Treated in our IVF unit for frozen-thawed embryo transfer

The above is a clinical trial inclusion criterion. Annotated with entity spans:
Treated in [Visit: our IVF unit] for [Procedure: frozen-thawed embryo transfer]